關於程序性鎮靜和止痛（procedural sedation and analgesia），下列敘述何者不適當？
A. Midazolam可使用於輕度技術鎮靜和止痛
B. Ketamine可使用於中度技術鎮靜和止痛
C. Etomidate可使用於輕度技術鎮靜和止痛
D. Propofol可使用於中度技術鎮靜和止痛

正確答案：C. Etomidate可使用於輕度技術鎮靜和止痛